Severe hypotension [resting SBP less than (<) 90mmHg, or resting DBP<50mmHg].

The above is a clinical trial exclusion criterion. Annotated with entity spans:
[Qualifier: Severe] [Condition: hypotension] [[Qualifier: resting] [Measurement: SBP] [Value: less than] (<) 90mmHg, or [Qualifier: resting] [Measurement: DBP][Value: <50mmHg]].